Clinical trial exclusion criterion:
Central + mixed apneas > 25% of the total apnea-hypopnea index (AHI)

Entity relations:
- Subsumes("total apnea-hypopnea index", "AHI")
- Has_value("total apnea-hypopnea index", "> 25%")
- AND("Central apneas", "total apnea-hypopnea index")
- OR("Central apneas", "mixed apneas")